Clinical trial exclusion criterion:
Abnormal APTT;

Entity relations:
- Has_value("APTT", "Abnormal")